Clinical trial inclusion criterion:
a baseline visual acuity ranging from a letter score of 0 to 70 on the Early Treatment Diabetic Retinopathy Study chart

Annotated entities:
- Measurement: "visual acuity"
- Temporal: "baseline"
- Value: "letter score of 0 to 70"
- Procedure: "Early Treatment Diabetic Retinopathy Study chart"